Sara de 33 años, embarazada de 8 meses y habitualmente continente, refiere que en ocasiones ha observado perdida de orina en pequeña cantidad al cambiarse la ropa, al reírse y al toser. Con los datos expuestos la persona presenta el diagnostico de enfermería, según NANDA Internacional, de:
1. Incontinencia urinaria de urgencia.
2. Incontinencia urinaria refleja.
3. Incontinencia urinaria funcional.
4. Incontinencia urinaria de esfuerzo.

Respuesta correcta: 4. Incontinencia urinaria de esfuerzo.